Clinical trial inclusion criterion:
Patients undergoing a high tibial osteotomy (HTO)

Entity relations:
- Has_temporal("high tibial osteotomy (HTO)", "undergoing")